Patients sensitive to chemicals used to induce sweating

The above is a clinical trial exclusion criterion. Annotated with entity spans:
Patients [Condition: sensitive to chemicals used to induce sweating]